Clinical trial exclusion criterion:
Active psychiatric disease (psychotic illness, major depression, or acute anxiety attacks) which prevents subject compliance with the requirements of the investigational study testing

Annotated entities:
- Condition: "psychiatric disease"
- Condition: "psychotic illness"
- Condition: "major depression"
- Condition: "acute anxiety attacks"